Clinical trial exclusion criterion:
Prior radiotherapy for primary tumor

Entity relations:
- Has_qualifier("tumor", "primary")
- Has_temporal("radiotherapy", "Prior")
- AND("radiotherapy", "tumor")